Clinical trial exclusion criterion:
known thromboembolic disease or with high risk of thromboembolism, warranting extra anticoagulation in connection with the procedure

Annotated entities:
- Condition: "thromboembolic disease"
- Mood: "high risk of"
- Condition: "thromboembolism"
- Procedure: "extra anticoagulation"